對於急性胰臟炎病患提早腸道營養灌食的敘述，下列何項不妥？
A. 可減少腸內的細菌轉位
B. 儘量使用鼻小腸管灌食或空腸灌食
C. 應使用低脂肪或元素飲食
D. 會增加感染的機會

正確答案：D. 會增加感染的機會